known arthritis.

The above is a clinical trial exclusion criterion. Annotated with entity spans:
known [Condition: arthritis].